1. Uncorrected congenital systemic-to-pulmonary shunt.

The above is a clinical trial exclusion criterion. Annotated with entity spans:
[Parsing_Error: 1.] [Qualifier: Uncorrected] [Condition: congenital systemic-to-pulmonary shunt].